Clinical trial inclusion criterion:
Severity of depression: A 24-Item Hamilton Depression Rating Scale (HDRS) = 20.

Annotated entities:
- Condition: "depression"
- Measurement: "24-Item Hamilton Depression Rating Scale"
- Measurement: "HDRS"
- Value: "= 20"